patients with cancer

The above is a clinical trial exclusion criterion. Annotated with entity spans:
patients with [Condition: cancer]